Clinical trial exclusion criterion:
Current medications with CNS effects

Annotated entities:
- Condition: "CNS effects"
- Drug: "medications"